Clinical trial inclusion criterion:
Meets 1 of the following: At least 12 months of spontaneous amenorrhea; At least 6 months of spontaneous amenorrhea with serum follicle-stimulating hormone (FSH) levels > 40 mIU/mL; At least 6 weeks postsurgical bilateral oophorectomy (with or without hysterectomy). Hysterectomized without bilateral oophorectomy and with serum FSH levels >40 mIU/mL.

Annotated entities:
- Temporal: "At least 12 months"
- Condition: "spontaneous amenorrhea"
- Temporal: "At least 6 months"
- Condition: "spontaneous amenorrhea"
- Measurement: "serum follicle-stimulating hormone (FSH) levels"
- Value: "> 40 mIU/mL"
- Temporal: "At least 6 weeks postsurgical"
- Procedure: "bilateral oophorectomy"
- Procedure: "bilateral oophorectomy without hysterectomy"
- Procedure: "bilateral oophorectomy with hysterectomy"
- Condition: "Hysterectomized"
- Procedure: "bilateral oophorectomy"
- Negation: "without"
- Measurement: "serum FSH levels"
- Value: ">40 mIU/mL"
- Line: "At least 12 months of spontaneous amenorrhea"
- Multiplier: "Meets 1 of the following"